Clinical trial exclusion criterion:
Patients with abnormal hematology or serum chemistry lab results

Annotated entities:
- Measurement: "serum chemistry lab"
- Measurement: "hematology lab"
- Value: "abnormal"